Clinical trial exclusion criterion:
4. Active opportunistic infection or active neurological disease that might confound evaluation.

Annotated entities:
- Condition: "opportunistic infection"
- Qualifier: "opportunistic"
- Temporal: "Active"
- Condition: "neurological disease"
- Temporal: "active"